如欲選擇valproate來治療急性躁症發作（acute mania），有效的血中濃度為多少µg/mL？
A. 0.6～1.2
B. 4～10
C. 10～15
D. 50～120

正確答案：D. 50～120